Clinical trial inclusion criteria:
a crown-rump length = 6mm and no cardiac activity OR
a crown-rump length <6mm and no fetal growth at least one week later OR
At least one week after diagnosis OR a discrepancy of at least one week between crown-rump length and calendar gestational age
Intra-uterine pregnancy
Women aged above 16 years
Hemodynamic stable patient
No signs of infection
No signs of incomplete abortion
No contraindications for mifepristone or misoprostol

Annotated entities:
- Measurement: "crown-rump length"
- Value: "= 6mm"
- Negation: "no"
- Observation: "cardiac activity"
- Measurement: "crown-rump length"
- Value: "<6mm"
- Negation: "no"
- Observation: "fetal growth"
- Temporal: "at least one week later"
- Temporal: "At least one week after diagnosis"
- Reference_point: "diagnosis"
- Condition: "discrepancy"
- Temporal: "at least one week between crown-rump length and calendar gestational age"
- Reference_point: "crown-rump length"
- Reference_point: "calendar gestational age"
- Condition: "Intra-uterine pregnancy"
- Person: "Women"
- Person: "aged"
- Value: "above 16 years"
- Condition: "Hemodynamic stable"
- Negation: "No"
- Condition: "signs of infection"
- Negation: "No"
- Condition: "signs of incomplete abortion"
- Negation: "No"
- Drug: "mifepristone"
- Drug: "misoprostol"
- Mood: "contraindications for"